Clinical trial inclusion criterion:
female or male of 50 to 85 years old with a care giver

Entity relations:
- Has_value("old", "50 to 85 years")